Subjects who have asthma

The above is a clinical trial exclusion criterion. Annotated with entity spans:
Subjects who have [Condition: asthma]